Entre las ventajas biológicas de la fiebre NO se encuentra.
1. Inhibe el crecimiento bacteriano.
2. Incrementa la actividad bactericida de los fagocitos.
3. Estimula la vía alternativa del complemento.
4. Estimula la síntesis de proteínas de fase aguda y de inmunoglobulinas.
5. Produce secuestro de hierro sérico.

Respuesta correcta: 3. Estimula la vía alternativa del complemento.